Clinical trial inclusion criterion:
Metabolic alkalosis

Annotated entities:
- Condition: "Metabolic alkalosis"